serum phosphorus <2.2mg/dl, osteoporosis

The above is a clinical trial exclusion criterion. Annotated with entity spans:
[Measurement: serum phosphorus] [Value: <2.2mg/dl], [Condition: osteoporosis]